Clinical trial inclusion criterion:
Male or female patients;

Annotated entities:
- Person: "Male"
- Person: "female"